Febrifugine could be repositioned for what diseases?

Febrifugine exerts potent antischistosomal effects and can be expected to contribute to the development of a novel antischistosomal drug. In addition, Prolyl-tRNA synthetase (PRS) drives protein translation in cells and are validated targets of febrifugine (FF) and its halogenated derivative halofuginone (HF). PRSs are of great interest for drug development against Plasmodium falciparum and Toxoplasma gondii. Febrifugine analogues have potential as Leishmania donovani trypanothione reductase inhibitors